Clinical trial inclusion criterion:
130mmHg=SBP<180mmHg, or 80mmHg=DBP<110mmHg or ongoing anti-hypertensive therapy;

Annotated entities:
- Value: "130mmHg"
- Measurement: "SBP"
- Value: "<180mmHg"
- Value: "80mmHg="
- Measurement: "DBP"
- Value: "<110mmHg"
- Temporal: "ongoing"
- Procedure: "anti-hypertensive therapy"